Clinical trial exclusion criterion:
Cardiogenic shock

Annotated entities:
- Condition: "Cardiogenic shock"